On colchicine chronically

The above is a clinical trial exclusion criterion. Annotated with entity spans:
On [Drug: colchicine] [Multiplier: chronically]